What kind of affinity purification would you use in order to isolate soluble lysosomal proteins?

The rationale for purification of the soluble lysosomal  proteins resides in their characteristic sugar, the mannose-6-phosphate (M6P),  which allows an easy purification by affinity chromatography on immobilized M6P receptors.